taking antibiotics or PPIs or bismuth salts within four weeks

The above is a clinical trial exclusion criterion. Annotated with entity spans:
taking [Drug: antibiotics] or [Drug: PPIs] or [Drug: bismuth salts] [Temporal: within four weeks]